Partial mole

The above is a clinical trial exclusion criterion. Annotated with entity spans:
[Condition: Partial mole]